Receptors of a first kidney transplant from an incompatible HLA living donor (at least 1 mismatch HLA at any antigenic level).

The above is a clinical trial inclusion criterion. Annotated with entity spans:
Receptors of a [Procedure: first kidney transplant] from an [Qualifier: incompatible HLA] [Qualifier: living donor] ([Multiplier: at least 1] [Observation: mismatch HLA] at any antigenic level).